Clinical trial inclusion criterion:
no allergy known to these drugs

Entity relations:
- AND("allergy", "these drugs")
- Has_negation("allergy", "no")